Patients who currently fulfil criteria for DSM-IV eating disorder, body dysmorphic disorder, current alcohol or substance abuse, or who have a lifetime history of bipolar disorder. Patients with a history of Schizophrenia and other psychotic disorders, Delirium, Dementia, and Amnestic and other cognitive disorders.

The above is a clinical trial exclusion criterion. Annotated with entity spans:
Patients who currently fulfil criteria for [Qualifier: DSM-IV] [Condition: eating disorder], [Condition: body dysmorphic disorder], current [Condition: alcohol] or [Condition: substance abuse], or who have a lifetime history of [Condition: bipolar disorder]. Patients with a history of [Condition: Schizophrenia] and [Qualifier: other] [Condition: psychotic disorders], [Condition: Delirium], [Condition: Dementia], and [Condition: Amnestic] and [Qualifier: other] [Condition: cognitive disorders].